一位50歲女性病人，無重大病史，因為過去12小時有發高燒、畏寒及腰痛，因此到急診就診，腎臟超音波顯 示腎臟並無結石或水腫，尿液中白血球為>100/HPF，但無紅血球（<2/HPF），血中白血球達18,000/mm3，病人在兩週前曾有頻尿及排尿灼熱感，但排尿症狀已經消失，下列何者錯誤？
A. 大腸桿菌（E. coli）是最常見的致病菌
B. 理學檢查可能發現肋骨脊柱三角（costo-vertebral angle）有敲痛感（knocking pain）
C. 通常需要做電腦斷層或靜脈腎盂攝影，進一步確定診斷
D. 如果沒有敗血症（septicemia）之症狀，可以考慮投予廣效性口服抗生素治療10～14天

正確答案：C. 通常需要做電腦斷層或靜脈腎盂攝影，進一步確定診斷